Clinical trial inclusion criterion:
Undergoing Assisted Reproductive Technique (ART) and oocyte maturation by human chorionic gonadotropin (HCG) triggering

Annotated entities:
- Procedure: "Assisted Reproductive Technique (ART)"
- Procedure: "oocyte maturation"
- Procedure: "human chorionic gonadotropin (HCG) triggering"
- Temporal: "Undergoing"